下列有關眼翳（pterygium）之敘述，何者正確？①侵入角膜之眼翳前緣，有時可見iron （stocker）line ②切除後復發之眼翳，有時比原發病灶更具侵入性 ③眼翳之成因，與高溫及過度暴露於紫外線有關 ④眼翳侵犯顳側角膜多於鼻側角膜
A. ①④
B. 僅①②
C. ①②③
D. 僅②③

正確答案：C. ①②③